下列有關瘧疾的敘述，何者正確？
A. 腦性瘧疾（cerebral malaria）是惡性瘧的併發症之一
B. 間日瘧患者最常見的併發症為腎病症候群（nephrotic syndrome）
C. 四種人類之瘧疾中，以惡性瘧的地理分布最廣
D. 台灣於瘧疾根除後之四十年間，所發現之瘧疾病例均係境外移入

正確答案：A. 腦性瘧疾（cerebral malaria）是惡性瘧的併發症之一